La fase prodrómica de un episodio psicótico se caracteriza por:
1. Una desviación del funcionamiento emocional, cognitivo, conductual o social y por la presencia de síntomas inespecíficos.
2. Ser un período crítico durante el cual la persona debe ser tratada.
3. La aparición del primer episodio psicótico.
4. Ser equiparable a lo que se denomina Duración de la Psicosis no tratada.
5. La recuperación funcional del paciente, lo que ocasiona que éste se pueda incorporar a la vida laboral de forma gradual.

Respuesta correcta: 1. Una desviación del funcionamiento emocional, cognitivo, conductual o social y por la presencia de síntomas inespecíficos.